Los padres de una niña de 2 años consultan porque están preocupados por el desarrollo de su hija. Han observado que aproximadamente desde los 18 meses, su comportamiento es diferente al de otros niños de su edad. Hasta entonces habían atribuido su escasa interacción a que se estaba haciendo más independiente, y la falta de desarrollo del lenguaje, a que aún no estaba escolarizada. En la consulta usted observa que la niña no responde cuando la llama por su nombre, muestra escaso contacto ocular, realiza vocalizaciones sin intención comunicativa, y no mira hacia donde los padres le señalan. Ante estos hallazgos, todas las siguientes afirmaciones son ciertas, EXCEPTO una:
1. Se debe tranquilizar a los padres, recomendando la escolarización tan pronto como sea posible, y concertar un seguimiento en 3 meses.
2. El diagnóstico más probable es de trastorno del espectro autista.
3. Se ha de realizar una evaluación diagnóstica por un equipo con experiencia en autismo.
4. Es recomendable una intervención temprana apropiada.
5. El origen del trastorno es multifactorial.

Respuesta correcta: 1. Se debe tranquilizar a los padres, recomendando la escolarización tan pronto como sea posible, y concertar un seguimiento en 3 meses.